有關創傷性腦組織損傷重症病患之處理原則，下列何者錯誤？
A. 目前處理創傷性腦組織血腫壓迫性損傷，仍以外科手術處理為主
B. 因創傷性腦組織損傷後造成腦壓過高，開顱減壓可以有效降低死亡率
C. 針對傷性腦組織損傷進行低溫療法，已確認可有效降低死亡率
D. 目前多中心研究顯示，以類固醇治療創傷性腦組織損傷，會增加致病與死亡率

正確答案：C. 針對傷性腦組織損傷進行低溫療法，已確認可有效降低死亡率